Subjects who have been treated over maximum maintenance dose (as specified in each label) of oral antipsychotics at screening. (e.g. Aripiprazole>30mg/day, Olanzapine>20mg/day, Risperidone > 6mg/day, Quetiapine > 750mg/day)

The above is a clinical trial exclusion criterion. Annotated with entity spans:
Subjects who have been treated over [Multiplier: maximum maintenance dose] (as specified in each label) of [Drug: oral antipsychotics] [Temporal: at screening]. (e.g. [Drug: Aripiprazole][Value: >30mg/day], [Drug: Olanzapine][Value: >20mg/day], [Drug: Risperidone] [Value: > 6mg/day], [Drug: Quetiapine] [Value: > 750mg/day])